Clinical trial exclusion criterion:
women undergoing caesarean section at less than 37 weeks of gestation.

Entity relations:
- Has_temporal("caesarean section", "undergoing")
- Has_value("gestation", "less than 37 weeks")
- AND("caesarean section", "gestation")